Pregnant or breastfeeding women

The above is a clinical trial exclusion criterion. Annotated with entity spans:
[Pregnancy_considerations: Pregnant or breastfeeding women]